Clinical trial exclusion criterion:
Known active cancer receiving treatment

Entity relations:
- Has_qualifier("cancer", "active")
- AND("cancer", "treatment")